Does the HercepTest use a polycloncal or monoclonal antibody?

The HercepTest uses a polyclonal antibody.